laparoscopic roux-en-y gastric bypass

The above is a clinical trial inclusion criterion. Annotated with entity spans:
[Qualifier: laparoscopic] [Procedure: roux-en-y gastric bypass]